Clinical trial inclusion criterion:
diagnosis of stroke (>6months);

Entity relations:
- Has_temporal("stroke", ">6months")